Clinical trial exclusion criterion:
cauda equina or conus lesion

Entity relations:
- Has_qualifier("lesion", "cauda equina")
- OR("cauda equina", "conus")